Clinical trial exclusion criterion:
previous adverse experience with study drugs

Entity relations:
- AND("adverse experience", "study drugs")
- Has_temporal("adverse experience", "previous")